Clinical trial exclusion criterion:
Inability of oral drug intake

Annotated entities:
- Mood: "Inability of"
- Drug: "oral drug"
- Observation: "oral drug intake"
- Negation: "Inability"